What is the applicability of the MCAST algorithm?

The MCAST algorithm uses a hidden Markov model with a P-value-based scoring scheme to identify candidate CRMs.